Clinical trial exclusion criterion:
Strict contraindication or inability to receive enteral medications;

Annotated entities:
- Condition: "contraindication"
- Procedure: "enteral medications"